At least an average of 4 seizures/week in baseline period.

The above is a clinical trial inclusion criterion. Annotated with entity spans:
[Multiplier: At least an average of 4] [Condition: seizures]/week in baseline period.